解剖無效腔（anatomic dead space）內氧氣（O2）與二氧化碳（CO2）之組成比例與下列何者最相近？
A. 肺泡（alveolus）內氣體
B. 大氣（atmospheric gas）
C. 肺泡微血管（alveolar capillary）內血液
D. 周邊微血管（peripheral capillary）內血液

正確答案：B. 大氣（atmospheric gas）